Clinical trial inclusion criterion:
2. Are 18 years of age or older

Annotated entities:
- Person: "of age"
- Value: "18 years or older"